Clinical trial inclusion criterion:
Patients must be over 65 years old.

Entity relations:
- Has_value("old", "over 65 years")